Operations in the past 6 months which could limit the erectile function

The above is a clinical trial exclusion criterion. Annotated with entity spans:
[Procedure: Operations] [Temporal: in the past 6 months] which could [Condition: limit the erectile function]